Clinical trial exclusion criterion:
Pregnant females

Annotated entities:
- Person: "females"
- Condition: "Pregnant"